30 歲男性，4 年前開始每年 10 至 12 月都會產生單側頭痛，頭痛每天發作一次，天天發作達 2 個月之久。頭痛多半在半夜發生，每次持續 30 分鐘至 1 小時，為重度、非搏動性疼痛，位於眼眶周圍。疼痛不因活動而增加，頭痛時不會噁心或嘔吐，也沒有畏光或怕吵等現象，但頭痛同側的眼睛會發紅流淚，同側鼻子也會鼻塞、流鼻涕。請問他最可能的診斷是：
A. 三叉神經痛（trigeminal neuralgia）
B. 偏頭痛（migraine）
C. 叢發性頭痛（cluster headache）
D. 緊縮型頭痛（tension-type headache）

正確答案：C. 叢發性頭痛（cluster headache）